Life expectancy greater than or equal to 6 months

The above is a clinical trial inclusion criterion. Annotated with entity spans:
[Observation: Life expectancy] [Value: greater than] or [Value: equal to 6 months]